35歲女性，因為月經1年沒來前來求診，1年半前自然產下第三胎，產後未哺餵母乳，至今也仍無月經來潮。進一步問診後，得知生產時因大量出血合併休克曾接受緊急輸血。下列何項檢	項目最無法幫助確診？
A. LH
B. FSH
C. Prolactin
D. CBC

正確答案：D. CBC